Clinical trial inclusion criterion:
Self-identified African American

Annotated entities:
- Person: "African American"